Post-bronchodilator spirometry will be performed approximately 15 minutes after the subject has self-administered 4 inhalations (i.e., total 400mcg) of albuterol/salbutamol via a metered dose inhaler (MDI )with a valved-holding chamber. The FEV1/FVC ratio and FEV1 percent predicted values will be calculated.

The above is a clinical trial inclusion criterion. Annotated with entity spans:
[Qualifier: Post-bronchodilator] [Procedure: spirometry] will be performed [Temporal: approximately 15 minutes after] the subject has [Qualifier: self-administered] [Multiplier: 4] [Procedure: inhalations] (i.e., total [Multiplier: 400mcg]) of [Drug: albuterol]/[Drug: salbutamol] via a [Procedure: metered dose inhaler (MDI )][Qualifier: with a valved-holding chamber]. The FEV1/FVC ratio and FEV1 percent predicted values will be calculated.